Niacin (must be on stable dose for ≥3 months);

The above is a clinical trial exclusion criterion. Annotated with entity spans:
[Drug: Niacin] (must be on [Qualifier: stable dose] for [Temporal: ≥3 months]);